Clinical trial exclusion criterion:
Columbia-Suicide Severity Rating Scale (C-SSRS) for suicidal ideation and behavior in past year.

Entity relations:
- Subsumes("Columbia-Suicide Severity Rating Scale", "C-SSRS")
- AND("Columbia-Suicide Severity Rating Scale", "suicidal ideation")
- Has_temporal("suicidal ideation", "in past year")
- OR("suicidal ideation", "suicidal behavior")